Respecto a las fases del desarrollo clínico de un medicamento, ¿cuál de las siguientes características NO corresponde a un ensayo clínico en fase 2?
1. Son estudios terapéuticos exploratorios.
2. Se realizan en un número amplio de pacientes (entre 100 y 1000).
3. Se utilizan para delimitar un intervalo de dosis terapéuticas.
4. Se requiere el consentimiento informado de los pacientes para su inclusión en el estudio.
5. Suelen ser de corta duración.

Respuesta correcta: 2. Se realizan en un número amplio de pacientes (entre 100 y 1000).